Patient refusal to participate in the study

The above is a clinical trial exclusion criterion. Annotated with entity spans:
[Informed_consent: Patient refusal to participate in the study]